Have at least one cardiovascular risk factor (eg, current smoker, high blood pressure, high cholesterol levels, diabetes mellitus, history of heart attack, family history of coronary heart disease, extra-articular RA disease)

The above is a clinical trial inclusion criterion. Annotated with entity spans:
Have [Multiplier: at least one] [Condition: cardiovascular risk factor] (eg, [Temporal: current] [Observation: smoker], [Condition: high blood pressure], [Condition: high cholesterol levels], [Condition: diabetes mellitus], [Temporal: history] of [Condition: heart attack], [Observation: family history] of [Condition: coronary heart disease], [Qualifier: extra-articular] [Condition: RA disease])